¿Cuál de estas características presentan las exotoxinas bacterianas?:
1. Las poseen todas las bacterias Gram negativas.
2. Son de naturaleza lipídica.
3. Se localizan en la membrana externa.
4. Introducen una respuesta inmunitaria escasa.
5. Algunas se emplean inactivadas como vacuna.

Respuesta correcta: 5. Algunas se emplean inactivadas como vacuna.